Approximately how many genes are contained in the X chromosome's non-pseudoautosomal region (non-PAR)?

The total number of genes contained in the X chromosome's non- pseudoautosomal region (PAR) is 783.